Clinical trial exclusion criterion:
Participation in another clinical trial at present or within 4 weeks of study entry. There may be exceptions at the discretion of the Investigator.

Annotated entities:
- Competing_trial: "articipation in another clinical trial at present or within 4 weeks of study entry. There may be exceptions at the discretion of the Investigator"
- Value: "Participation"